3. Participated in any other research study within 60 days prior to screening

The above is a clinical trial exclusion criterion. Annotated with entity spans:
3. [Context_Error: Participated in any other research study within 60 days prior to screening]